Impending or frank perforation at recruitment

The above is a clinical trial exclusion criterion. Annotated with entity spans:
Impending or frank [Condition: perforation] at recruitment